Clinical trial exclusion criterion:
severe valve disease requiring valve replacement

Annotated entities:
- Qualifier: "severe"
- Condition: "valve disease"
- Qualifier: "requiring valve replacement"
- Procedure: "valve replacement"